Histologic diagnosis of chondrosarcoma, verifiable after enrollment

The above is a clinical trial inclusion criterion. Annotated with entity spans:
[Measurement: Histologic] diagnosis of [Condition: chondrosarcoma], verifiable after enrollment